一位64歲男性，有酗酒習慣及酒精性肝硬化病史，有一天未喝酒，因為意識混亂、躁動冒汗、視幻覺而被送至急診處。據其家屬描述，病患前幾天並無發燒、頭痛之症狀，體溫38℃，脈搏132次/min，呼吸24次/min，血壓160/100 mmHg，此病患最可能的診斷為：
A. 酒精戒斷引起之顫妄症（delirium tremens）
B. 腦膜炎
C. 酒精性酮酸血症
D. 敗血症

正確答案：A. 酒精戒斷引起之顫妄症（delirium tremens）